下列那一種藥物具有減緩動暈症（motion sickness）所引起的嘔吐作用？
A. Desipramine
B. Chlorpromazine
C. Imipramine
D. Fluoxetine

正確答案：B. Chlorpromazine